Clinical trial exclusion criterion:
Organ dysfunction (renal/hepatic failure or leukemia)

Entity relations:
- Subsumes("Organ dysfunction", "renal failure")
- OR("renal failure", "leukemia", "hepatic failure")